依據醫療法的規定，醫療機構實施手術，應向病人或其法定代理人、配偶、親屬或關係人說明手術原因、手術成功率或可能發生之併發症及危險，並經其同意，簽具手術同意書及麻醉同意書，始得為之。但什麼樣的情況不在此限？
A. 情況緊急者
B. 自費病人
C. 門診手術
D. 內視鏡手術

正確答案：A. 情況緊急者